3. Has a condition or history that, in the opinion of the investigator, may interfere significantly with the subject's participation in the study.

The above is a clinical trial exclusion criterion. Annotated with entity spans:
[Parsing_Error: 3.] Has a condition or history that, [Subjective_judgement: in the opinion of the investigator], [Subjective_judgement: may interfere significantly] with the subject's participation in the study.